Clinical trial inclusion criterion:
3. Subject's lesion(s) is (are) amenable to stent treatment with currently available FDA-approved bare metal or drug eluting stents.

Annotated entities:
- Device: "drug eluting stents"
- Condition: "amenable to stent treatment"
- Device: "bare metal stents"